1. Patient has an allergy to nickel.

The above is a clinical trial exclusion criterion. Annotated with entity spans:
1. Patient has an [Condition: allergy to nickel].